Los ribosomas de las mitocondrias de los mamíferos:
1. Son iguales a los del citoplasma de las células eucariotas.
2. Poseen RNA ribosómicos 16S y 12S.
3. Sintetizan todas las proteínas mitocondriales.
4. Poseen dos subunidades de igual tamaño y estructura.

Respuesta correcta: 2. Poseen RNA ribosómicos 16S y 12S.